El glucagón estimula:
1. Glucogenosíntesis.
2. Formación de depósitos de grasas.
3. Síntesis de proteínas.
4. Secreción de insulina.
5. Glucolisis.

Respuesta correcta: 4. Secreción de insulina.